Clinical trial exclusion criterion:
Known carrier or infection for HIV/Hep B or C. HCV ab+ must be PCR-. HBV ab+ must be HBsAg- or undetectable DNA

Entity relations:
- Has_qualifier("HCV ab+", "PCR-")
- Has_qualifier("HBV ab+", "HBsAg-")
- OR("infection for HIV", "Hep B infection for", "Hep C infection for")
- OR("infection for HIV", "HCV ab+", "HBV ab+")